Able to swallow pills

The above is a clinical trial inclusion criterion. Annotated with entity spans:
[Post-eligibility: Able to swallow pills]